Clinical trial exclusion criterion:
Presence of arrhythmia (including atrial fibrillation, atrial flutter, or 2nd or 3rd degree atrioventricular block)

Entity relations:
- Subsumes("arrhythmia", "atrial fibrillation")
- OR("atrial fibrillation", "atrial flutter", "2nd degree atrioventricular block", "3rd degree atrioventricular block")